En los animales, ¿dónde se sintetiza la mayoría de los componentes del material extracelular?:
1. En el retículo endoplasmático liso.
2. En el retículo endoplasmático rugoso.
3. En la propia capa extracelular.
4. En la membrana plasmática.
5. En el citoplasma de la célula.

Respuesta correcta: 2. En el retículo endoplasmático rugoso.